specific brain related disorder (such as tuberous sclerosis)

The above is a clinical trial exclusion criterion. Annotated with entity spans:
specific [Qualifier: brain] related [Condition: disorder] (such as [Condition: tuberous sclerosis])